Clinical trial inclusion criterion:
Breastfed exclusively or predominantly (>50% meals) at inclusion

Entity relations:
- Subsumes("exclusively", ">50% meals")
- Has_qualifier("Breastfed", "exclusively")
- Has_temporal("Breastfed", "at inclusion")
- OR("exclusively", "predominantly")